¿Qué molécula producen los ácidos grasos de cadena impar en la tiolisis del último ciclo de oxidación?:
1. Enoil-CoA.
2. Acetil-CoA.
3. Linoleil-CoA.
4. Propionil-CoA.

Respuesta correcta: 4. Propionil-CoA.